(relative) Contraindications for FA or ICGA;

The above is a clinical trial exclusion criterion. Annotated with entity spans:
(relative) [Condition: Contraindications] for [Procedure: FA] or [Procedure: ICGA];